Clinical trial exclusion criterion:
Contraindications to empagliflozin, Sitagliptin

Annotated entities:
- Condition: "Contraindications"
- Drug: "empagliflozin"
- Drug: "Sitagliptin"